Clinical trial exclusion criterion:
Previous vaccination against diphtheria, tetanus, pertussis, polio, hepatitis B, Haemophilus influenzae type b, and/or S. pneumoniae with the exception of vaccines where the first dose can be given within the first two weeks of life according to the national recommendations

Entity relations:
- Has_temporal("first dose can be given", "within the first two weeks of life")
- AND("vaccination", "diphtheria")
- Has_qualifier("vaccines", "first dose can be given")
- Has_negation("vaccines", "with the exception of")
- AND("vaccination", "vaccines")
- Has_index("within the first two weeks of life", "the first two weeks of life")
- OR("diphtheria", "tetanus", "pertussis", "polio", "hepatitis B", "Haemophilus influenzae type b", "S. pneumoniae")